Clinical trial exclusion criterion:
Subject with clinically significant chronic hematological disease which could lead to priapism such as sickle cell anemia, multiple myeloma, and leukemia

Annotated entities:
- Condition: "hematological disease"
- Qualifier: "chronic"
- Qualifier: "could lead to priapism"
- Condition: "sickle cell anemia"
- Condition: "multiple myeloma"
- Condition: "leukemia"
- Qualifier: "clinically significant"
- Condition: "priapism"